Known pregnancy or breast-feeding.

The above is a clinical trial exclusion criterion. Annotated with entity spans:
Known [Condition: pregnancy] or [Condition: breast-feeding].